Clinical trial exclusion criterion:
Chronic use of opioid and sedatives

Entity relations:
- Has_multiplier("opioid", "Chronic use")
- OR("opioid", "sedatives")